一名中年婦女在餐廳工作，切雞肉時不慎將左手食指指尖一併剁下，隨即送到急診室。檢查發現切 口整齊，位在指甲橫向二分之一處，但未達指甲生發層（germinal matrix）合併指骨外露，依據 fingertip 
 amputation 之分類 Allen's classification，此狀況應屬何種 type？
A. Type I
B. Type II
C. Type III
D. Type IV

正確答案：B. Type II